關於海洛英成癮（heroin dependence）患者的脫癮藥物治療，下列何者較不恰當？
A. 美沙冬（methadone）
B. 嗎啡（morphine）
C. 拿淬松（naltrexone）
D. 丁基原啡因（buprenorphine）

正確答案：B. 嗎啡（morphine）